What drug, used to treat rheumatoid arthritis, is an interleukin-1 receptor antagonist?

Anakinra is an anti-IL-1RA targeting IL-1beta with a central role in the occurrence of auto-inflammatory diseases.